La hipótesis quimiosmótica propone que se forma ATP debido a cuál de las razones siguientes:
1. Cambio de permeabilidad de la membrana mitocondrial interna del ADP.
2. Formación de enlaces de energía elevada en las proteínas mitocondriales.
3. Bombeo de ADP fuera de la matriz al espacio intermembrana.
4. Formación de un gradiente de protones a través de la membrana interna.

Respuesta correcta: 4. Formación de un gradiente de protones a través de la membrana interna.